Clinical trial exclusion criterion:
not a regular user of e-cigarettes

Annotated entities:
- Person: "regular user"
- Procedure: "e-cigarettes"
- Negation: "not"